current diagnosis of a mood, anxiety, or other disorder that is more clinically salient than PTSD

The above is a clinical trial exclusion criterion. Annotated with entity spans:
current diagnosis of a [Condition: mood], [Condition: anxiety], or [Qualifier: other] [Condition: disorder] that is [Qualifier: more clinically salient than PTSD]